Traumatic Brain Injury (TBI) with a clear impact on activities of daily living

The above is a clinical trial exclusion criterion. Annotated with entity spans:
[Condition: Traumatic Brain Injury (TBI)] with a clear [Condition: impact on activities of daily living]